Clinical trial exclusion criterion:
Untreated thyrotoxicosis.

Annotated entities:
- Condition: "thyrotoxicosis"
- Qualifier: "Untreated"